Clinical trial exclusion criterion:
Currently participate in a resistance training or high impact weight bearing exercise program two or more times weekly

Annotated entities:
- Condition: "participate in a resistance training"
- Non-query-able: "participate in a resistance training"
- Condition: "participate in high impact weight bearing exercise"
- Non-query-able: "participate in high impact weight bearing exercise"
- Multiplier: "two or more times weekly"